Patients must have adequate organ function as defined by the following laboratory criteria:

The above is a clinical trial inclusion criterion. Annotated with entity spans:
Patients must have [Observation: adequate organ function] as defined by the following laboratory criteria: